一位 14 歲男童一星期前在學校尿液篩檢發現有蛋白尿。在醫院之尿液常規檢查發現 protein： >300 mg/dL；WBC 0～2/HPF；RBC 0～2/HPF。3 天前之 24 小時尿液分析結果 protein：0.85 g/24 hr。但據男童之母親描述，過去 3 日男童起床後之第一泡尿液以驗尿試紙檢測均為陰性反應。已排除驗尿試紙偽陰性反應。下列何者為最可能之診斷？
A. 姿態性蛋白尿（postural proteinuria）
B. 腎絲球性蛋白尿（glomerular proteinuria）
C. 腎小管性蛋白尿（tubular proteinuria）
D. 腎病症候群（nephrotic syndrome）

正確答案：A. 姿態性蛋白尿（postural proteinuria）